Clinical trial inclusion criterion:
Age 10 to 65 years

Annotated entities:
- Person: "Age"
- Value: "10 to 65 years"